Previous chemotherapy or radiotherapy must have been performed ≥ 8 weeks prior to study entry.

The above is a clinical trial inclusion criterion. Annotated with entity spans:
[Temporal: Previous] [Procedure: chemotherapy] or [Procedure: radiotherapy] must have been performed [Temporal: ≥ 8 weeks prior to study entry].